Clinical trial exclusion criterion:
contraindication for combined antiplatelet treatment

Entity relations:
- AND("contraindication", "combined antiplatelet treatment")